Clinical trial inclusion criterion:
Elevated triglycerides (=150 mg/dl), or on medication for treating the condition

Entity relations:
- Has_value("triglycerides", "Elevated")
- Subsumes("Elevated", "=150 mg/dl")
- Has_qualifier("medication for treating", "triglycerides")